下列有關夜間陰莖膨脹測	（nocturnal penile tumescence）結果的判讀，何者錯誤？
A. 健康男人一晚有三至五次勃起
B. 勃起多發生在快速動眼期（rapid eye movement stage）
C. 如果一個病人整晚都無勃起現象，即為器官性陽痿
D. 勃起硬度達90%以上，持續一小時，即可診斷為器官性勃起功能正常

正確答案：C. 如果一個病人整晚都無勃起現象，即為器官性陽痿